一位 38 歲女性，近一年內共出現 4 次憂鬱發作，經換數種抗鬱劑治療後卻轉變成暴躁易怒、思考變靈光、話多、活動量增加，且亂刷卡，造成家人極大困擾。下列敘述何者錯誤？
A. 單用抗鬱劑治療常無法改善雙極性疾患（bipolar disorder）之憂鬱發作，而需合併情緒穩定劑
B. 新的情緒穩定劑 lamotrigine 對雙極性疾患的憂鬱發作之預防優於對躁症發作之預防
C. 緩慢增加 lamotrigine 劑量較不會引起史蒂芬－強生症候群（Stevens-Johnson Syndrome）等副作用
D. 快速循環型（rapid cycling）的原因主要與遺傳有關，與藥物及壓力皆無關聯

正確答案：D. 快速循環型（rapid cycling）的原因主要與遺傳有關，與藥物及壓力皆無關聯